En relación con la risperidona, señale la respuesta CORRECTA:
1. Es un antipsicótico clásico o de primera generación.
2. Está relacionada estructuralmente con las fenotiazinas.
3. No produce una mejoría clínica significativa sobre los síntomas afectivos asociados a la esquizofrenia.
4. Produce reacciones extrapiramidales de forma dosis-dependiente.

Respuesta correcta: 4. Produce reacciones extrapiramidales de forma dosis-dependiente.